Clinical trial inclusion criterion:
Women without PCOS as defined by the Rotterdam criteria.

Annotated entities:
- Negation: "without"
- Condition: "PCOS"
- Qualifier: "Rotterdam criteria"